Adult male and female aged 19 to 75 years

The above is a clinical trial inclusion criterion. Annotated with entity spans:
Adult [Person: male] and [Person: female] [Person: aged] [Value: 19 to 75 years]